chromosome aberrations in anyone of the couple.

The above is a clinical trial exclusion criterion. Annotated with entity spans:
[Condition: chromosome aberrations] in [Observation: anyone of the couple].